Clinical trial inclusion criterion:
History of hypersensitivity to any of the study drugs or its excipients or to drugs of similar chemical classes.

Entity relations:
- AND("study drugs", "excipients")
- AND("hypersensitivity", "study drugs")
- OR("study drugs", "drugs of similar chemical classes")